Clinical trial exclusion criterion:
Weight loss drugs other than metformin

Entity relations:
- AND("Weight loss", "metformin")
- Has_negation("metformin", "other")